Clinical trial inclusion criterion:
Have had one prior platinum-based chemotherapy regimen for the treatment of primary disease.

Annotated entities:
- Drug: "platinum-based chemotherapy regimen"
- Condition: "primary disease"
- Temporal: "prior"